下列細胞週期中控制 DNA 複製的時期為：
A. G1
B. S
C. G2
D. M

正確答案：B. S